Atrial fibrillation on sub-optimal OAC

The above is a clinical trial inclusion criterion. Annotated with entity spans:
[Condition: Atrial fibrillation] on [Qualifier: sub-optimal] [Procedure: OAC]